The participant with laboratory data meeting any of the following:

The above is a clinical trial exclusion criterion. Annotated with entity spans:
[Parsing_Error: The participant with laboratory data meeting any of the following:]